Dentro de los problemas de salud emergentes se encuentra el Trastorno por Déficit de Atención e Hiperactividad (TDAH). Señale con cuál de las siguientes actividades la enfermera de familia puede adelantar su detección y abordaje:
1. Revisar cuidadosamente los hitos del desarrollo y la adquisición de habilidades sociales, pues desde el nacimiento muestran síntomas.
2. Prestar atención a la información de la familia sobre el desarrollo motor grosero, pues suelen aparecer señales precoces e inequívocas del TDAH.
3. Observar y valorar cuidadosamente al niño o a la niña, respecto a sus distracciones, impulsividad y a su capacidad para concentrarse y responder a nuestras preguntas.
4. Valorar las actividades en la consulta de todos los niños y niñas pues los que sufren TDAH siempre son hiperactivos y agresivos y registrarlos como tales.
5. Las respuestas 1 y 2 son correctas.

Respuesta correcta: 3. Observar y valorar cuidadosamente al niño o a la niña, respecto a sus distracciones, impulsividad y a su capacidad para concentrarse y responder a nuestras preguntas.